Clinical trial exclusion criterion:
Prior chemotherapy Prior treatment with gefitinib, erlotinib, or other drugs that target EGFR Patients must not be receiving any other investigational agents Any evidence of interstitial lung disease

Entity relations:
- Has_temporal("treatment", "Prior")
- Has_temporal("chemotherapy", "Prior")
- AND("treatment", "gefitinib")
- OR("gefitinib", "erlotinib", "drugs that target EGFR")